下列何者不是中央極限定理（central limit theorem）的涵義？
A. 隨機樣本平均值（sample mean）之統計分布接近常態分布（normal distribution）
B. 隨機樣本平均值（sample mean）之統計分布接近布阿松分布（Poisson distribution）
C. 所有可能的隨機樣本平均值（sample mean）之平均值等於母群體（original population）平均值
D. 標準誤（standard error）取決於母群體（original population）標準差與樣本的大小（size of sample）

正確答案：B. 隨機樣本平均值（sample mean）之統計分布接近布阿松分布（Poisson distribution）